Statins (dose must be ≤ half the maximum dose; must be on a stable dose ≥3 months);

The above is a clinical trial exclusion criterion. Annotated with entity spans:
[Drug: Statins] (dose must be [Multiplier: ≤ half the maximum dose]; must be on a [Qualifier: stable dose] [Temporal: ≥3 months]);